What 3 organs are the sphincter of Oddi associated with?

The sphincter of Oddi is associated with the pancreatic duct, the duodenal crypts and gallbladder.